En la β-oxidación de ácidos grasos de cadena impar, ¿cuál es la molécula que se forma con los tres últimos carbonos para entrar en el ciclo del ácido cítrico?:
1. Propionil-CoA.
2. Metilmalonil-CoA.
3. Succinil-CoA.
4. Succinato.
5. Malato.

Respuesta correcta: 3. Succinil-CoA.